Un paciente con gastroenteritis por Salmonella, acude a la consulta. El paciente está deshidratado. ¿Qué tratamiento le darías, sabiendo que, previamente, el paciente no tenía ninguna enfermedad?
1. Amoxicilina endovenosa.
2. Ciprofloxacino oral.
3. Ceftriaxona intramuscular.
4. Hidratación oral o endovenosa.

Respuesta correcta: 4. Hidratación oral o endovenosa.